Clinical trial inclusion criterion:
Histological diagnosis confirmed by two endoscopies with biopsies and two pathological readings; biopsies should be carried out according to the protocol of the SFED (four-quadrant biopsies every cm) with at least once acetic acid for staining. Operators describe Barrett's esophagus using he SFED planimetric model. The final exam will be no more than two months before the date of treatment and should have been achieved in investigator establishment,

Annotated entities:
- Qualifier: "Histological"
- Procedure: "Histological"
- Multiplier: "two"
- Procedure: "endoscopies"
- Procedure: "biopsies"
- Multiplier: "two"
- Procedure: "pathological readings"
- Condition: "diagnosis"
- Non-representable: "biopsies should be carried out according to the protocol of the SFED (four-quadrant biopsies every cm) with at least once acetic acid for staining."
- Non-representable: "Operators describe Barrett's esophagus using he SFED planimetric model."
- Non-representable: "The final exam will be no more than two months before the date of treatment and should have been achieved in investigator establishment,"